Presence or history of thromboembolic disease as judged by the investigator

The above is a clinical trial exclusion criterion. Annotated with entity spans:
[Parsing_Error: Presence or history] of [Condition: thromboembolic disease] [Subjective_judgement: as judged by the investigator]